下列有關心室肌細胞之離子電流及動作電位之關係的敘述，何者錯誤？
A. 第零期去極化，主要之離子電流為鈉離子流
B. 第二期（高原期），主要之離子電流為鈣離子流
C. 第三期再極化，主要之離子電流為鉀離子流
D. 第四期，主要之離子電流為鈣離子流

正確答案：D. 第四期，主要之離子電流為鈣離子流